Clinical trial exclusion criterion:
Known pancreatic, renal, hepatic, heart or thyroid diseased

Entity relations:
- OR("pancreatic disease", "hepatic disease", "thyroid disease", "renal disease", "heart disease")